En la resolución de un problema, los métodos de búsqueda heurística:
1. Exploran de forma exhaustiva todos los posibles trayectos dentro del espacio problema.
2. Reducen el proceso de búsqueda a aquellas alternativas que se aproximen mejor a la solución.
3. Garantizan encontrar la solución óptima a un problema.
4. No tienen en cuenta la información externa al contexto del problema.

Respuesta correcta: 2. Reducen el proceso de búsqueda a aquellas alternativas que se aproximen mejor a la solución.